Clinical trial exclusion criterion:
Lactating patients

Annotated entities:
- Condition: "Lactating"